Clinical trial exclusion criterion:
Previous atrial ablation.

Annotated entities:
- Procedure: "atrial ablation"